Clinical trial inclusion criteria:
Early Syphilis Cases Determined to Be Serofast at 6 Months after Initial Treatment

Annotated entities:
- Condition: "Early Syphilis"
- Qualifier: "Serofast"
- Temporal: "6 Months after Initial Treatment"
- Reference_point: "Initial Treatment"
- Procedure: "Treatment"
- Multiplier: "Initial"